Clinical trial exclusion criterion:
Patients previously treated with steroid, anti-cancer medicine, or immunosuppression treatment before CA;

Annotated entities:
- Drug: "anti-cancer medicine"
- Drug: "steroid"
- Procedure: "immunosuppression treatment"
- Temporal: "before CA"
- Condition: "CA"
- Temporal: "previously"
- Procedure: "treated"